Clinical trial exclusion criterion:
1. Currently pregnant or last pregnancy outcome within 3 months prior to enrolment

Annotated entities:
- Condition: "pregnant"
- Condition: "pregnancy outcome"
- Temporal: "within 3 months prior to enrolment"
- Reference_point: "enrolment"
- Qualifier: "last"
- Temporal: "last"
- Temporal: "Currently"